Age >/=18 years at screening

The above is a clinical trial inclusion criterion. Annotated with entity spans:
[Person: Age] [Value: >/=18 years] [Temporal: at screening]